Clinical trial exclusion criteria:
allergy to Doxycycline or Methylprednisolone,
pregnancy,
diagnosis,
Inflammatory arthritis or diabetes,
secondary adhesive capsulitis (history of significant trauma, rotator cuff tear injury, stroke)
evidence of arthritis on x-ray,
current infectious disease, and
any previous treatment for the for adhesive capsulitis of the affected shoulder.

Annotated entities:
- Drug: "Doxycycline"
- Drug: "Methylprednisolone"
- Condition: "allergy"
- Condition: "pregnancy"
- Condition: "diagnosis"
- Condition: "Inflammatory arthritis"
- Condition: "diabetes"
- Qualifier: "secondary"
- Condition: "adhesive capsulitis"
- Temporal: "history"
- Qualifier: "significant"
- Condition: "trauma"
- Condition: "rotator cuff tear injury"
- Condition: "stroke"
- Mood: "evidence of"
- Condition: "arthritis"
- Procedure: "x-ray"
- Temporal: "current"
- Condition: "infectious disease"
- Qualifier: "any"
- Temporal: "previous"
- Procedure: "treatment"
- Condition: "adhesive capsulitis"
- Qualifier: "affected shoulder"